Clinical trial exclusion criterion:
Receiving steroids at the time of transplantation or likely to need steroids after transplantation.

Annotated entities:
- Drug: "steroids"
- Procedure: "Receiving"
- Temporal: "at the time of transplantation"
- Reference_point: "transplantation"
- Mood: "likely to need"
- Drug: "steroids"
- Temporal: "after transplantation"
- Reference_point: "transplantation"